Clinical trial exclusion criterion:
Patients with chronic and acute inflammatory conditions such as sepsis, rheumatoid arthritis, ectopic dermatitis, asthma, ulcerative colitis.

Entity relations:
- Subsumes("inflammatory conditions", "sepsis")
- Has_qualifier("inflammatory conditions", "chronic")
- OR("chronic", "acute")
- OR("sepsis", "ulcerative colitis", "ectopic dermatitis", "rheumatoid arthritis", "asthma")